Clinical trial exclusion criterion:
Active infection with human cytomegaly virus (HCMV), Epstein-Barr virus (EBV), varicella-zoster virus (VZV)

Annotated entities:
- Qualifier: "human cytomegaly virus"
- Qualifier: "HCMV"
- Qualifier: "Epstein-Barr virus"
- Qualifier: "EBV"
- Qualifier: "varicella-zoster virus"
- Qualifier: "VZV"
- Condition: "infection"
- Qualifier: "Active"